Clinical trial inclusion criterion:
Scheduled to undergo revision total knee arthroplasty

Annotated entities:
- Procedure: "revision total knee arthroplasty"